關於虹膜（iris）的敘述，何項錯誤？
A. 虹膜屬於眼球之纖維層（tunica fibrosa）
B. 眼球之前房及後房（anterior & posterior chamber）是以虹膜為界限
C. 虹膜的開口（即瞳孔pupil）藉由平滑肌作用控制
D. 虹膜基質內含血管及神經纖維

正確答案：A. 虹膜屬於眼球之纖維層（tunica fibrosa）